Clinical trial inclusion criterion:
Ability to measure atrial and/or ventricular pacing threshold(s) at 0.4 or 0.5 ms

Annotated entities:
- Post-eligibility: "Ability to measure atrial and/or ventricular pacing threshold(s) at 0.4 or 0.5 ms"